Clinical trial exclusion criterion:
Subject has a life expectancy of less than three (3) years.

Entity relations:
- Has_value("life expectancy", "less than three (3) years")